Clinical trial inclusion criterion:
Resting heart rate =80 bpm

Entity relations:
- Has_value("Resting heart rate", "=80 bpm")